進行性上核型退化症（Progressive supranuclear palsy）最具代表性的臨床症狀是：
A. 直立性低血壓（Orthostatic hypotension）
B. 小便失禁（Urine incontinence）
C. 垂直性動眼麻痺（Vertical gaze palsy）
D. 小腦性步態失調（Gait ataxia）

正確答案：C. 垂直性動眼麻痺（Vertical gaze palsy）